Clinical trial exclusion criterion:
Currently taking aspirin or a statin.

Annotated entities:
- Drug: "aspirin"
- Drug: "statin"